Clinical trial inclusion criterion:
Previous intolerance to kava

Entity relations:
- AND("intolerance", "kava")
- Has_temporal("intolerance", "Previous")